Clinical trial inclusion criterion:
Patients = 18 years of age

Entity relations:
- Has_value("age", "= 18 years")